Subjects with medical conditions that preclude the testing required by the protocol or limit study participation

The above is a clinical trial exclusion criterion. Annotated with entity spans:
Subjects with [Condition: medical conditions] that [Condition: preclude] the [Procedure: testing required by the protoco]l or [Condition: limit study participation]